Es de secreción exclusivamente serosa la glándula:
1. Parótida.
2. Submaxilar o submandibular.
3. Sublingual.
4. Hígado.

Respuesta correcta: 1. Parótida.